Clinical trial inclusion criterion:
Decompression of the spinal cord following total or partial cervical vertebrectomy

Entity relations:
- AND("total cervical vertebrectomy", "Decompression of the spinal cord")
- OR("total cervical vertebrectomy", "partial cervical vertebrectomy")